Earlier operations in the foot and leg, that is judged to complicate training

The above is a clinical trial exclusion criterion. Annotated with entity spans:
[Non-query-able: Earlier operations in the foot and leg, that is judged to complicate training]